Clinical trial exclusion criterion:
Drugs related to acetylcholine metabolism

Annotated entities:
- Drug: "Drugs"
- Qualifier: "related to acetylcholine metabolis"
- Drug: "acetylcholine"